Clinical trial inclusion criterion:
At least 18 years of age

Annotated entities:
- Person: "age"
- Value: "At least 18 years"